24. HIV-positive

The above is a clinical trial exclusion criterion. Annotated with entity spans:
[Parsing_Error: 24.] [Measurement: HIV]-[Value: positive]